Clinical trial inclusion criterion:
WBC >_3500/mm3, platelet count >_100,000/mm3.

Annotated entities:
- Measurement: "WBC"
- Value: ">_3500/mm3"
- Measurement: "platelet count"
- Value: ">_100,000/mm3"